Clinical trial exclusion criterion:
incooperative for glucose monitor

Entity relations:
- AND("incooperative", "glucose monitor")